下列關於心臟瓣膜疾病，何者正確？①暈厥（syncope）為重度主動脈瓣狹窄之手術適應症之一 ②僧帽瓣修補術可用於擴張性心肌症（dilated cardiomyopathy）患者的手術治療 ③心臟移植手術可用於心臟瓣膜疾病患的手術治療 ④僧帽瓣修補的手術死亡率比僧帽瓣置換術的手術死亡率高
A. ①②③
B. 僅①③
C. ②④
D. 僅④

正確答案：A. ①②③